Clinical trial exclusion criterion:
Current inpatient hospitalization or active suicidal ideation requiring referral for inpatient hospitalization for safety.

Entity relations:
- AND("hospitalization", "inpatient")
- Has_temporal("hospitalization", "Current")
- Has_temporal("suicidal ideation", "active")
- AND("referral", "inpatient hospitalization")
- Has_mood("referral", "requiring")
- AND("suicidal ideation", "referral")
- OR("hospitalization", "suicidal ideation")